Clinical trial inclusion criterion:
Has clear corneas and no active ocular disease

Annotated entities:
- Condition: "clear corneas"
- Condition: "ocular disease"
- Negation: "no"
- Temporal: "active"